Clinical trial inclusion criterion:
Axial spondyloarthritis (ASAS criteria) and radiologic sacroiliitis as detected either by MRI or X-ray.

Entity relations:
- Has_qualifier("Axial spondyloarthritis", "ASAS criteria")
- AND("sacroiliitis", "radiologic")
- AND("sacroiliitis", "MRI")
- OR("MRI", "X-ray")